下列有關自體免疫疾病-HLA 的配對中，何者相關性最高？
A. systemic lupus erythematosus-HLA-A8
B. rheumatoid arthritis-HLA-DR4
C. Behçet's disease-HLA-C51
D. chronic active hepatitis-HLA-B27

正確答案：B. rheumatoid arthritis-HLA-DR4